Clinical trial exclusion criterion:
Subject has pulmonary vein stent.

Annotated entities:
- Device: "pulmonary vein stent"